Clinical trial exclusion criterion:
Actively wheezing at time of enrollment or history of asthma complications

Annotated entities:
- Temporal: "at time of enrollment"
- Reference_point: "enrollment"
- Condition: "asthma complications"
- Condition: "wheezing"